Clinical trial exclusion criteria:
Weight < 800 g;
Airway anomalies;
Pulmonary air leaks;
Craniofacial or cardiothoracic malformations

Annotated entities:
- Measurement: "Weight"
- Value: "< 800 g"
- Condition: "Airway anomalies"
- Condition: "Pulmonary air leaks"
- Condition: "cardiothoracic malformations"
- Condition: "Craniofacial malformations"